78 歲的高老先生患有高血壓多年，因腦出血住院，請問高血壓性腦出血，最常見的出血位置為何？
A. 大腦皮質
B. 基底核
C. 腦幹
D. 小腦

正確答案：B. 基底核